Screening Hamilton Depression Rating Scale (HAMD) = 18; and Baseline HAMD = 15.

The above is a clinical trial inclusion criterion. Annotated with entity spans:
[Measurement: Screening Hamilton Depression Rating Scale] ([Measurement: HAMD]) [Value: = 18]; and [Qualifier: Baseline] [Measurement: HAMD] [Value: = 15].